Modified Allen or Barbeau test should be positive (presence of collateral palmar flow).

The above is a clinical trial inclusion criterion. Annotated with entity spans:
[Measurement: Modified Allen] or [Measurement: Barbeau test] should be [Value: positive] ([Qualifier: presence] of [Condition: collateral palmar flow]).